Clinical trial inclusion criteria:
Cases (with a history of TBI):
1. Ages 50-95 years
2. History of traumatic brain injury of sufficient severity to have resulted in medical attention (ascertained via the Ohio State University TBI Identification Questionnaire—OSU TBI-ID, and based on DoD/VA criteria)
3. Residence in AFRH-Washington D.C. or the Veterans Home of California-Yountville
4. MMSE score ≥ 20
5. Capacity to provide consent to participate in research (assessment made by study physician)
6. Ability to read and write English
Controls (without a history of TBI):
1. Ages 50-95 years
2. No history of traumatic brain injury of sufficient severity to have resulted in medical attention (ascertained via the Ohio State University TBI Identification Questionnaire—OSU TBI-ID)
3. Residence in AFRH-Washington or the Veterans Home of California-Yountville
4. MMSE score ≥ 20
5. Capacity to provide consent or assent to participate in research
6. Ability to read and write English -

Annotated entities:
- Parsing_Error: "Cases (with a history of TBI):"
- Person: "Ages"
- Value: "50-95 years"
- Condition: "traumatic brain injury"
- Temporal: "History"
- Qualifier: "sufficient severity"
- Subjective_judgement: "sufficient severity"
- Measurement: "Ohio State University TBI Identification Questionnaire—OSU TBI-ID"
- Value: "sufficient severity"
- Visit: "AFRH-Washington D.C."
- Visit: "Veterans Home of California-Yountville"
- Observation: "Residence"
- Measurement: "MMSE"
- Value: "score ≥ 20"
- Non-query-able: "Capacity to provide consent to participate in research (assessment made by study physician)"
- Post-eligibility: "Capacity to provide consent to participate in research (assessment made by study physician)"
- Non-query-able: "Ability to read and write English"
- Post-eligibility: "Ability to read and write English"
- Parsing_Error: "Controls (without a history of TBI):"
- Person: "Ages"
- Value: "50-95 years"
- Condition: "traumatic brain injury"
- Qualifier: "sufficient severity"
- Measurement: "Ohio State University TBI Identification Questionnaire—OSU TBI-ID"
- Negation: "No"
- Temporal: "history"
- Subjective_judgement: "sufficient severity"
- Value: "sufficient severity"
- Visit: "AFRH-Washington"
- Visit: "Veterans Home of California-Yountville"
- Observation: "Residence"
- Measurement: "MMSE"
- Value: "score ≥ 20"
- Non-query-able: "Capacity to provide consent or assent to participate in research"
- Post-eligibility: "Capacity to provide consent or assent to participate in research"
- Post-eligibility: "Ability to read and write English -"
- Non-query-able: "Ability to read and write English -"